A una mujer diagnosticada de Trastorno de Ansiedad Generalizada le solicitamos que no envié continuos whassaps a su hija cuando ésta pasa fuera de casa el fin de semana, y no vaya a recogerla con su coche a la salida de la discoteca cada sábado. Estaríamos aplicando la técnica conocida como:
1. Inducción de la rumiación.
2. Prevención de las conductas de preocupación.
3. Evitación encubierta.
4. Desfocalización del apego.

Respuesta correcta: 2. Prevención de las conductas de preocupación.